Chronic pain for at least 3 months prior to inclusion, measured by VAS. (VAS 4 or above);

The above is a clinical trial inclusion criterion. Annotated with entity spans:
[Condition: Chronic pain] for [Temporal: at least 3 months prior] to [Reference_point: inclusion], [Qualifier: measured by VAS]. [Parsing_Error: (VAS 4 or above);]